Clinical trial exclusion criterion:
Presence of organic pathology identified by upper endoscopy or other investigations

Entity relations:
- AND("upper endoscopy", "organic pathology")
- OR("upper endoscopy", "investigations")